Clinical trial exclusion criterion:
Complicated pharyngitis

Entity relations:
- Has_qualifier("pharyngitis", "Complicated")